50 歲男性，6 年前開始，家人發現他走路時，左手擺動較少，但他自己並不覺得困擾也沒吃藥。2 年後，左手、左腳動作變得更僵硬與緩慢，3 年前，病患發現他用右手做事情時也變得比較笨拙。因此他開始服用藥物。在最近 3 年來他也發現只要吃了左多巴胺（L-dopa），這些症狀便會完全消失， 但藥效只能維持約 4 小時。這 6 年來，他完全沒有顫抖之情形。請問他最有可能是得了什麼病？
A. 多發性腦退化之巴金森氏症（multiple systemic atrophy-parkinsonian type; MSA-P）
B. 皮質基底核退化症（cortico-basal degeneration, CBD）
C. 帕金森氏病（Parkinson's disease）
D. 多發性硬化症（multiple sclerosis）

正確答案：C. 帕金森氏病（Parkinson's disease）